El periodo de latencia de un virus:
1. Dura menos que su fase eclipse.
2. También se conoce como fase de eclipse.
3. Culmina con el ensamblaje de los viriones en el interior de la célula.
4. Finaliza con la liberación de los nuevos viriones al exterior.

Respuesta correcta: 4. Finaliza con la liberación de los nuevos viriones al exterior.